Smoking by subject or other person in the subject's bedroom, or other open flame in bedroom

The above is a clinical trial exclusion criterion. Annotated with entity spans:
[Non-query-able: Smoking by subject or other person in the subject's bedroom, or other open flame in bedroom]